Clinical trial inclusion criterion:
Patient must have been on a commercially approved anticoagulation therapy for at least two (2) months prior to randomization in the OAT Study.

Entity relations:
- Has_index("at least two (2) months prior to randomization", "randomization")
- Has_temporal("anticoagulation therapy", "at least two (2) months prior to randomization")